Clinical trial exclusion criterion:
Concurrent prescription of medicines for ADHD or medicines that significantly could affect test performance.

Annotated entities:
- Drug: "medicines"
- Condition: "ADHD"